En general, se debe aumentar la ingesta hídrica en los pacientes sometidos a quimioterapia con el objetivo de:
1. Prevenir daño renal.
2. Fluidificar las secreciones bronquiales.
3. Aliviar las náuseas postquimioterapia.
4. Aumentar la volemia.
5. Disminuir el riesgo de infección.

Respuesta correcta: 1. Prevenir daño renal.